Presence of vomiting

The above is a clinical trial exclusion criterion. Annotated with entity spans:
Presence of [Condition: vomiting]